Clinical trial exclusion criterion:
Pre-existing/chronic back pain

Annotated entities:
- Qualifier: "chronic"
- Temporal: "Pre-existing"
- Condition: "back pain"